Clinical trial exclusion criterion:
6. Persistent clinically significant non-hematological toxicity that is Grade >1 by NCI CTCAE v4 from prior chemotherapy

Entity relations:
- Has_qualifier("toxicity", "non-hematological")
- Has_qualifier("toxicity", "clinically significant")
- Has_value("NCI CTCAE v4", "Grade >1")
- Has_qualifier("toxicity", "Grade >1 by NCI CTCAE v4")
- Has_temporal("chemotherapy", "prior")
- causal("toxicity", "chemotherapy")
- multi("Grade >1 by NCI CTCAE v4", "NCI CTCAE v4")